下列有關曼氏血吸蟲（Schistosoma mansoni）感染之敘述，那些是錯誤的？①可由糞便檢查到具尾刺 （terminal spine）的蟲卵而確診 ②病患在慢性感染期較易引起左葉肝臟腫大 ③病患可能因生食水螺，其囊幼（metacercaria）進入體內而感染
A. 僅①②
B. 僅①③
C. 僅②③
D. ①②③

正確答案：B. 僅①③